Pregnancy (positive B-HCG test performed a maxima 72h before) or breastfeeding

The above is a clinical trial exclusion criterion. Annotated with entity spans:
[Condition: Pregnancy] ([Value: positive] [Measurement: B-HCG test] performed [Temporal: a maxima 72h before]) or [Observation: breastfeeding]